Clinical trial inclusion criterion:
Signed informed consent by patient, legal representative or authorized person or deferred consent

Annotated entities:
- Post-eligibility: "Signed informed consent by patient, legal representative or authorized person or deferred consent"